Clinical trial exclusion criterion:
severe respiratory disease;

Annotated entities:
- Qualifier: "severe"
- Condition: "respiratory disease"